Clinical trial exclusion criterion:
Patients who have planning for follow-up in another center

Annotated entities:
- Mood: "planning for"
- Procedure: "follow-up"
- Visit: "another center"